Clinical trial exclusion criterion:
History of excessive alcohol use, drug abuse or significant psychiatric illness

Entity relations:
- Has_qualifier("psychiatric illness", "significant")
- Has_temporal("excessive alcohol use", "History")
- OR("excessive alcohol use", "drug abuse", "psychiatric illness")